Uncontrolled and ongoing psychiatric diseases;

The above is a clinical trial exclusion criterion. Annotated with entity spans:
[Qualifier: Uncontrolled] and [Temporal: ongoing] [Condition: psychiatric diseases];